下列那一種方法無法控制干擾效應（confounding）？
A. 收樣時配對（matching）干擾因子
B. 資料分析時校正（adjustment）干擾因子
C. 資料分析時以干擾因子做分層（stratification）分析
D. 收樣時增加樣本數

正確答案：D. 收樣時增加樣本數